pregnant or nursing patients

The above is a clinical trial exclusion criterion. Annotated with entity spans:
[Pregnancy_considerations: pregnant or nursing patients]